Dentro de la epidemiología y factores de riesgo en el carcinoma de pene. ¿Cuál es la respuesta FALSA?
1. El 95% de los casos de tumores malignos de pene son carcinomas escamosos.
2. Las parejas femeninas de pacientes varones con cáncer de pene no tienen una incidencia mayor de cáncer de cérvix.
3. La afectación por el virus del papiloma humano (HPV) en sus subtipos 16 y 18, incrementa el riesgo de cáncer de pene.
4. La vacunación para el HPV de los niños varones es una recomendación en el actual calendario.

Respuesta correcta: 4. La vacunación para el HPV de los niños varones es una recomendación en el actual calendario.